有關良性骨腫瘤之敘述，下列何者錯誤？
A. 骨軟骨瘤（osteochondroma）是常見的良性骨骼腫瘤，往往不須手術切除，亦不會有惡性變化的機會
B. 骨樣骨瘤（osteoid osteoma）大多發生在青少年，手術時切除腫瘤中之病巢（nidus），即可解決疼痛
C. 動脈瘤性骨囊腫（aneurysmal bone cyst）好發於青少年，可於電腦斷層攝影下發現 fluid-fluid level 現象
D. 單純性骨囊腫（simple bone cyst）好發於肱骨及股骨近端

正確答案：A. 骨軟骨瘤（osteochondroma）是常見的良性骨骼腫瘤，往往不須手術切除，亦不會有惡性變化的機會